Clinical trial exclusion criterion:
Patient has any protocol-excluded or clinically significant medical or surgical history that could confound the study assessments

Annotated entities:
- Qualifier: "protocol-excluded"
- Qualifier: "clinically significant"
- Temporal: "surgical history"
- Temporal: "medical history"
- Qualifier: "could confound the study assessments"
- Post-eligibility: "Patient has any protocol-excluded or clinically significant medical or surgical history that could confound the study assessments"